Clinical trial exclusion criterion:
Ocular disorders in the study eye that may confound interpretation of study results

Annotated entities:
- Non-query-able: "Ocular disorders in the study eye that may confound interpretation of study results"